Clinical trial exclusion criterion:
Current diabetes mellitus.

Annotated entities:
- Condition: "diabetes mellitus"